下列與滲透（osmosis）有關之描述，何者正確？
A. osmolarity 是指每公升（liter）溶劑（solvent）中滲透度（osmoles）之多寡
B. osmolality 是指每公升溶液（solution）中滲透度之多寡
C. osmolarity 是指每公斤（kilogram）溶液中滲透度之多寡
D. osmolarity 易受溶液中溶質（solutes）的濃度的變異而影響

正確答案：D. osmolarity 易受溶液中溶質（solutes）的濃度的變異而影響